26 歲男性，身高 178 公分，體重 63 公斤，過往健康情況良好。某天深夜打電腦時突然右側胸痛及呼吸困難。聽診發現左側呼吸聲音比右側明顯許多。請問以下那一項處置較不恰當？
A. 安排支氣管鏡檢查是否有右側支氣管異物
B. 安排胸部 X 光攝影
C. 給予氧氣治療
D. 準備放置胸管的器械及用品

正確答案：A. 安排支氣管鏡檢查是否有右側支氣管異物